Clinical trial inclusion criterion:
Female patient who is = 18yrs, and = 65yrs.

Annotated entities:
- Person: "Female"
- Value: "= 18yrs"
- Value: "= 65yrs"